Clinical trial exclusion criterion:
Severe malnutrition

Annotated entities:
- Qualifier: "Severe"
- Condition: "malnutrition"